La ecuación que describe el efecto de la constante dieléctrica del disolvente sobre la constante de velocidad de las reacciones en disolución entre compuestos iónicos, predice que:
1. La representación de la constante de velocidad, k, frente a la inversa de la constante dieléctrica del disolvente debe de ser lineal.
2. Al reemplazar el agua por un disolvente de menor constante dieléctrica siempre se reducirá la velocidad de reacción.
3. Las reacciones que involucran iones del mismo signo se aceleran con disolventes de baja constante dieléctrica, ε.
4. Las reacciones que involucran iones con signos opuestos se aceleran con disolventes de baja constante dieléctrica, ε.

Respuesta correcta: 4. Las reacciones que involucran iones con signos opuestos se aceleran con disolventes de baja constante dieléctrica, ε.